Durante la síntesis de proteínas, la enzima que cataliza la formación del enlace peptídico es la:
1. Peptidasa.
2. Peptidil-ligasa.
3. Peptidil-sintetasa.
4. Peptidil-transferasa.

Respuesta correcta: 4. Peptidil-transferasa.